Clinical trial inclusion criterion:
with at least one occlusal or occlusal proximal caries lesion in primary molars

Annotated entities:
- Multiplier: "at least one"
- Qualifier: "occlusal proximal"
- Qualifier: "occlusal"
- Condition: "caries lesion"
- Qualifier: "primary molars"